翼管神經（Vidian nerve）含有下列那一種神經纖維？
A. 副交感神經之節後纖維
B. 交感神經之節前纖維
C. 交感神經之節後纖維
D. 前篩神經纖維

正確答案：C. 交感神經之節後纖維